關於各種不同的生物工程皮膚替代物（bioengineered skin substitutes）的優點與缺點，下列敘述何者錯誤？
A. 培養的異體角質細胞（allogeneic keratinocyte graft）有傷口覆蓋與促進癒合的優點
B. 培養的異體角質細胞（allogeneic keratinocyte graft）缺點是脆弱且無法避免傷口攣縮
C. 生物工程真皮替代物（bioengineered dermal replacement）大部分只能當作暫時性的傷口覆蓋
D. 生物工程真皮替代物（bioengineered dermal replacement）優點是具有優異的引導上皮化（reepithelialization）的能力

正確答案：D. 生物工程真皮替代物（bioengineered dermal replacement）優點是具有優異的引導上皮化（reepithelialization）的能力